下列何者與聽覺無關？
A. 外側蹄系（lateral lemniscus）
B. 下橄欖核（inferior olivary nucleus）
C. 螺旋神經節（spiral ganglion）
D. 內側膝狀體（medial geniculate body）

正確答案：B. 下橄欖核（inferior olivary nucleus）